Clinical trial exclusion criterion:
Malabsorption syndrome or other condition that precludes enteral route of administration

Entity relations:
- OR("Malabsorption syndrome", "condition that precludes enteral route of administration")